下面 E. coli 那一個酵素，其人類同源（homologous）基因是屬於抑癌基因？
A. DNA 聚合酶Ⅲ
B. 修護酶 Mut S
C. RNA 聚合酶
D. 解螺旋酶（helicase）

正確答案：B. 修護酶 Mut S